一位 5 歲腦性麻痺病患，走路時雙腳呈現踮腳尖（tip toes walking）及剪刀腳步態（scissor gait），下列何項治療對改善其步態無幫忙？
A. 拉筋（stretch exercise）
B. 穿戴踝足副木支架（ankle-foot orthoses）
C. 施打肉毒桿菌（botox）
D. 經皮電刺激（transcutaneous electrical nerve stimulation）

正確答案：D. 經皮電刺激（transcutaneous electrical nerve stimulation）